Provide written, signed and dated informed consent prior to initiating any study-related activities.

The above is a clinical trial inclusion criterion. Annotated with entity spans:
[Informed_consent: Provide written, signed and dated informed consent prior to initiating any study-related activities.]